Patients presenting with ST-elevation acute myocardial infarction (STEMI) within 12 hours of their symptom onset in whom TIMI-3 flow was established in infarct related artery (IRA) after balloon angioplasty or thrombectomy.

The above is a clinical trial inclusion criterion. Annotated with entity spans:
Patients presenting with [Condition: ST-elevation acute myocardial infarction (STEMI)] [Temporal: within 12 hours of their symptom onset] in whom [Observation: TIMI-3 flow was established] in [Qualifier: infarct related artery (IRA)] [Temporal: after balloon angioplasty or thrombectomy].